Clinical trial inclusion criterion:
Neutrophils ≥1.5 x 109/L.

Annotated entities:
- Measurement: "Neutrophils"
- Value: "≥1.5 x 109/L"